Clinical trial exclusion criterion:
8. Subjects who plan to have cardiac transplantation;

Annotated entities:
- Procedure: "cardiac transplantation"
- Mood: "plan"